下列關於精神分裂症預後的敘述，何者錯誤？
A. 年輕男性，高教育程度，病前功能佳者，比較容易出現有自殺的危險
B. 愈早發病而且有退縮自閉的行為預後愈差
C. 有情感性症狀者預後較差
D. 有負性症狀者比有正性症狀者預後差

正確答案：C. 有情感性症狀者預後較差